Clinical trial exclusion criterion:
Continues on corticosteroids in previous 3 months prior to randomisation

Entity relations:
- Has_index("previous 3 months prior to randomisation", "randomisation")
- Has_temporal("corticosteroids", "previous 3 months prior to randomisation")